下列何者可作為葡萄糖新生作用（gluconeogenesis）的前體（precursor）？
A. glycerol
B. leucine
C. palmitic acid
D. glycine

正確答案：A. glycerol